一位 27 歲懷孕 16 週婦女接受羊膜腔穿刺檢查，檢查結果胎兒染色體為 47,XXY，她決定終止懷孕。 年之後該婦女再次懷孕，下列何種處理最適當？
A. 告知再發染色體異常機會較高，可以接受羊膜腔穿刺檢查
B. 告知再發染色體異常機會並未較常人高
C. 告知前胎染色體為 47,XXY 並非嚴重問題
D. 建議夫妻接受血液染色體檢查，若夫妻染色體正常，就不會有問題

正確答案：A. 告知再發染色體異常機會較高，可以接受羊膜腔穿刺檢查